某計程車司機之睡眠型態如下：晚上11點就寢後約15分鐘內可以入睡，但多於凌晨3點左右醒來便輾轉難再入睡，直到清晨6點左右可再入睡，但7點則必須起床開始工作，因此開車時精神不濟。若欲短期投以藥物給該個案，下列何種藥物比較適合其睡眠型態？
A. 非緩釋劑型之zolpidem
B. 短效之benzodiazepines
C. 中效之benzodiazepines
D. 具有鎮靜安眠效果之抗精神病藥

正確答案：C. 中效之benzodiazepines